Clinical trial exclusion criterion:
Proteinuria > 0,5 g/l;

Annotated entities:
- Condition: "Proteinuria"
- Multiplier: "> 0,5 g/l"